Clinical trial exclusion criterion:
Contra-indication for multiorgan procurement (infections, cancer, etc)

Entity relations:
- AND("Contra-indication", "multiorgan procurement")
- Subsumes("Contra-indication", "infections")
- OR("infections", "cancer")